MRI contraindications

The above is a clinical trial exclusion criterion. Annotated with entity spans:
[Procedure: MRI] [Condition: contraindications]